Hepatic disease or biliary tract obstruction, or significant hepatic enzyme elevation (alanine transaminase or Aspartate Aminotransferase > 3 times upper limit of normal)

The above is a clinical trial exclusion criterion. Annotated with entity spans:
[Condition: Hepatic disease] or [Condition: biliary tract obstruction], or [Qualifier: significant] [Condition: hepatic enzyme elevation] ([Measurement: alanine transaminase] or [Measurement: Aspartate Aminotransferase] [Value: > 3 times upper limit of normal])